Clinical trial exclusion criterion:
Use of any oral antidiabetic treatment except for metformin (i.e., sulphonylureas, DPP-IV inhibitors, thiazolidinediones, SGLT-2 inhibitors (Sodium dependent glucose transporter) or GLP-1 analogues (glucagone like peptide) within the last three months prior to Screening

Annotated entities:
- Procedure: "oral antidiabetic treatment"
- Drug: "oral antidiabetic"
- Negation: "except for"
- Drug: "metformin"
- Drug: "sulphonylureas"
- Drug: "DPP-IV inhibitors"
- Drug: "thiazolidinediones"
- Drug: "SGLT-2 inhibitors"
- Drug: "GLP-1 analogues"
- Temporal: "within the last three months prior to Screening"
- Reference_point: "Screening"